下列有關中樞聽覺傳導路徑的敘述，何者最正確？
A. cochlear nuclei →inferior colliculus→medial geniculate body→auditory cortex
B. cochlear nuclei→superior colliculus→medial geniculate body→auditory cortex
C. cochlear nuclei→inferior colliculus→lateral geniculate body→auditory cortex
D. cochlear nuclei→superior colliculus→lateral geniculate body→auditory cortex

正確答案：A. cochlear nuclei →inferior colliculus→medial geniculate body→auditory cortex